Paciente de 70 años de edad diagnosticado hace tres años de mieloma múltiple que está en periodo de neutropenia tras un ciclo de quimioterapia. Ingresa por fiebre, tos y expectoración amarillenta. La radiografía de tórax muestra una imagen de condensación en hemitórax derecho. El diagnóstico mas probable es:
1. Neumonitis tóxica postquimioterapia.
2. Neumonía neumocócica.
3. Neumonía por aspergillus.
4. Neumonía vírica por virus respiratorio comunitario.
5. Neumonía por citomegalovirus.

Respuesta correcta: 2. Neumonía neumocócica.